一位 31 歲女性，G1P0，妊娠 38 週，診斷為「前置胎盤」。她最適當的分娩方式為何？
A. 自然生產
B. 真空吸引分娩
C. 產鉗
D. 剖腹生產

正確答案：D. 剖腹生產